Clinical trial exclusion criterion:
Leukopenia (WBC < 3000 cell/mL), acute anemia (Hgb < 9 g/dL), Thrombocytopenia (Plt < 50,000 cell/mL).

Annotated entities:
- Condition: "Leukopenia"
- Measurement: "WBC"
- Value: "< 3000 cell/mL"
- Condition: "acute anemia"
- Measurement: "Hgb"
- Value: "< 9 g/dL"
- Condition: "Thrombocytopenia"
- Measurement: "Plt"
- Value: "< 50,000 cell/mL"